Palliative indication due to reasons other than surgical candidate status

The above is a clinical trial exclusion criterion. Annotated with entity spans:
[Non-query-able: Palliative indication due to reasons other than surgical candidate status]